Participating in another clinical trial.

The above is a clinical trial exclusion criterion. Annotated with entity spans:
[Non-query-able: Participating in another clinical trial].